Known renal failure or allergy to acetazolamide and other sulfonamides

The above is a clinical trial exclusion criterion. Annotated with entity spans:
Known [Condition: renal failure] or [Condition: allergy] to [Drug: acetazolamide] and [Qualifier: other] [Drug: sulfonamides]